Creatinine clearance <30 mL/min

The above is a clinical trial exclusion criterion. Annotated with entity spans:
[Measurement: Creatinine clearance] [Value: <30 mL/min]